¿Cuál de los siguientes datos NO corresponde a una vulvovaginitis por hongos?:
1. El embarazo aumenta el riesgo de esta infección.
2. Puede presentarse en mujeres que nunca tuvieron relaciones sexuales.
3. Es típica la secreción vaginal con placas o grumos blancos adheridos a las paredes de la vagina.
4. Se puede diagnosticar en un frotis en fresco de la secreción vaginal sin necesidad de tinción.
5. Al añadir una gota de potasa a la secreción vaginal se desprende un fuerte olor a pescado.

Respuesta correcta: 5. Al añadir una gota de potasa a la secreción vaginal se desprende un fuerte olor a pescado.